Clinical trial exclusion criteria:
Psychiatric disorders other than insomnia, PTSD and specific phobias; including bipolar and psychotic disorders and meeting criteria for DSM-5 moderate alcohol or drug use disorders within the past year.
Diagnosis of a sleep disorder other than insomnia including PSG findings of apnea/hypopnea or periodic limb movement indices > 10/hour;
Medical conditions that require consistent use of medication or compromise sleep;
History of moderate to severe traumatic brain injury or mild traumatic brain injury with ongoing post-concussive symptoms;
Suicidal ideation with intent to act or with specific plan and intent in the past 6 months (Type 4 - 5 ideation on the Columbia Suicide Severity Rating Scale) or a concerning history of prior suicidal behavior.
Caffeine use exceeding 5 cups of coffee per day or its equivalent;
Habitual bedtimes after 3 AM, habitual rise times after 10 AM, or habitual napping > 1hour/day;
Pregnancy or breastfeeding, or expecting to conceive while in study;
Positive urine toxicology.

Annotated entities:
- Condition: "Psychiatric disorders"
- Negation: "other"
- Condition: "insomnia"
- Condition: "PTSD"
- Condition: "phobias"
- Condition: "bipolar"
- Condition: "psychotic disorders"
- Temporal: "past year"
- Qualifier: "DSM-5"
- Qualifier: "moderate"
- Condition: "drug use disorders"
- Condition: "alcohol use disorders"
- Condition: "sleep disorder"
- Negation: "other"
- Condition: "insomnia"
- Condition: "apnea"
- Condition: "hypopnea"
- Measurement: "periodic limb movement indices"
- Value: "> 10/hour"
- Measurement: "PSG"
- Non-query-able: "Medical conditions that require consistent use of medication or compromise sleep"
- Condition: "traumatic brain injury"
- Qualifier: "moderate"
- Qualifier: "severe"
- Condition: "traumatic brain injury"
- Qualifier: "mild"
- Condition: "post-concussive symptoms"
- Condition: "Suicidal ideation"
- Temporal: "past 6 months"
- Measurement: "Columbia Suicide Severity Rating Scale"
- Value: "Type 5 ideation"
- Value: "Type 4 ideation"
- Condition: "suicidal behavior."
- Drug: "Caffeine"
- Non-query-able: "Caffeine use exceeding 5 cups of coffee per day or its equivalent"
- Non-query-able: "Habitual bedtimes after 3 AM, habitual rise times after 10 AM, or habitual napping > 1hour/day"
- Pregnancy_considerations: "Pregnancy or breastfeeding, or expecting to conceive while in study"
- Measurement: "urine toxicology"
- Value: "Positive"